Clinical trial exclusion criterion:
Weight <45kg

Entity relations:
- Has_value("Weight", "<45kg")